Clinical trial inclusion criterion:
Patients must be on stable hypoglycemic medications for at least 8 weeks prior to Visit 2 ( Day -1).

Entity relations:
- Has_temporal("hypoglycemic medications", "at least 8 weeks prior to Visit 2")
- Has_qualifier("hypoglycemic medications", "stable")
- Has_index("at least 8 weeks prior to Visit 2", "Visit 2")